Para estimar el aclaramiento plasmático de un fármaco (CLIR) que presenta un comportamiento cinético lineal y se excreta de forma significativa por la orina, en un paciente con insuficiencia renal (IR), es preciso conocer:
1. El aclaramiento de creatinina en el paciente urémico (CLcrIR) y en individuos con función renal normal (CLcrFRN).
2. El aclaramiento renal del fármaco en pacientes con función renal normal (CLrFRN), CLcrIR y CLcrFRN.
3. La fracción de fármaco excretada en forma inalterada por la orina (fr), la dosis administrada (D), CLrFRN, CLcrIR y CLcrFRN.
4. fr, CLcrIR y CLcrFRN y el aclaramiento plasmático del fármaco en pacientes con función renal normal
5. fr, CLrFRN, CLcrIR , CLcrFRN y D.

Respuesta correcta: 4. fr, CLcrIR y CLcrFRN y el aclaramiento plasmático del fármaco en pacientes con función renal normal